Clinical trial exclusion criterion:
Uncontrolled thyroid disorders.

Annotated entities:
- Condition: "thyroid disorders"
- Qualifier: "Uncontrolled"